Clinical trial exclusion criterion:
Traumatic Brain Injury (TBI) with a clear impact on activities of daily living

Entity relations:
- AND("Traumatic Brain Injury (TBI)", "impact on activities of daily living")